Clinical trial exclusion criterion:
Patients included in another trial or having been given investigational drugs within 12 weeks prior to screening

Annotated entities:
- Post-eligibility: "Patients included in another trial or having been given investigational drugs within 12 weeks prior to screening"